metal implants / objects in the body that may interfere with MRI

The above is a clinical trial exclusion criterion. Annotated with entity spans:
[Device: metal implants] / objects in the body that [Mood: may interfere with] [Procedure: MRI]